Clinical trial inclusion criterion:
Born after a gestation period between 36 and 42 weeks.

Entity relations:
- Has_value("gestation period", "between 36 and 42 weeks")
- AND("Born", "gestation period")